Clinical trial inclusion criterion:
Rapid-antigen detection test (RADT) positive for GAS-

Annotated entities:
- Measurement: "RADT"
- Measurement: "Rapid-antigen detection test"
- Value: "positive"
- Qualifier: "GAS-"